有一肝硬化病人，在海邊不慎被魚刺扎到，約 12 小時後，傷口及附近皮膚出現蜂窩組織炎水泡及壞死現象，且迅速蔓延。下列何者是最可能的致病菌？
A. 創傷弧菌（Vibrio vulnificus）
B. A 群鏈球菌（Group A streptococcus）
C. 綠膿桿菌（Pseudomonas aeruginosa）
D. 金黃葡萄球菌（Staphylococcus aureus）

正確答案：A. 創傷弧菌（Vibrio vulnificus）